Clinical trial exclusion criterion:
Giant papillary conjunctivitis (GCP) worse than grade 1

Annotated entities:
- Condition: "Giant papillary conjunctivitis (GCP)"
- Qualifier: "worse than grade 1"